Clinical trial exclusion criterion:
Hemoglobin A1c (HbA1C) > 11%

Entity relations:
- Has_value("Hemoglobin A1c (HbA1C)", "> 11%")